What is blepharospasm?

Blepharospasm means involuntary twitching, blinking or closure of the eyelids resulting from any cause.